Clinical trial inclusion criterion:
Patients must be at least 21 years old.

Entity relations:
- Has_value("old", "at least 21 years")